Clinical trial inclusion criterion:
Patients free of active respiratory disease such as acute respiratory signs/symptoms (e.g., wheezing) or with active airways disease (asthma, chronic obstructive pulmonary disease or emphysema).

Entity relations:
- Has_qualifier("respiratory disease", "active")
- Has_negation("respiratory disease", "free")
- Has_qualifier("airways disease", "active")
- Has_negation("airways disease", "free")
- Subsumes("airways disease", "asthma")
- Subsumes("acute respiratory symptoms", "wheezing")
- Subsumes("respiratory disease", "acute respiratory signs")
- OR("asthma", "chronic obstructive pulmonary disease", "emphysema")
- OR("acute respiratory signs", "acute respiratory symptoms")